Clinical trial inclusion criterion:
Need for long-term oral anticoagulation;

Annotated entities:
- Mood: "Need for"
- Procedure: "long-term oral anticoagulation"